Clinical trial exclusion criterion:
cardiac or non-cardiac illness with life expectancy of less than two years;

Annotated entities:
- Condition: "non-cardiac illness"
- Condition: "cardiac illness"
- Observation: "life expectancy"
- Value: "less than two years"